Clinical trial inclusion criterion:
Atopic dermatitis subjects who are coincident with Hanifin and Rajka diagnosis criteria

Entity relations:
- AND("Atopic dermatitis", "Hanifin and Rajka diagnosis criteria")